Clinical trial inclusion criterion:
Blasts < 1,000/µL in PB on day 8

Annotated entities:
- Line: "Blasts < 1,000/µL in PB on day 8"
- Measurement: "Blasts"
- Value: "< 1,000/µL"
- Condition: "PB"
- Temporal: "on day 8"